Mujer de 68 años, con antecedentes de 2 episodios depresivos mayores a lo largo de su vida, que consulta por síntomas de tristeza, decaimiento, anhedonia, astenia y anorexia compatibles con un nuevo episodio depresivo. Se pautan 10 mg de escitalopram y se evalúa 2 semanas después. En esta revisión la paciente refiere estar muy bien, se despierta temprano muy hiperactiva y con muchas ganas de hacer cosas, dice tener mucha energía y está más habladora de lo que en ella es habitual. No refiere estar irritable y es capaz de dormir 6 horas continuadamente. Ante esta situación, ¿qué pensaría que tiene la paciente?
1. Trastorno bipolar tipo I.
2. Hipomanía inducida por fármacos.
3. Respuesta normal al escitalopram.
4. Demencia frontal.

Respuesta correcta: 2. Hipomanía inducida por fármacos.